22歲尚未有性經	的女生，因為近一年內體重不斷增加而求診。身高150公分，目前體重80公斤，過去的一年月經都延遲相當久才來，最長的一次達3個月。經腹部超音波量測竇室濾泡數（antral follicle count）為20，子宮內膜厚度為15 mm，目前沒有交往對象也尚無生育考量。下列建議何者最不合適？
A. 給予排卵藥
B. 給予黃體素
C. 建議積極減重和調整生活及飲食習慣
D. 建議做糖尿病及胰島素抗性篩檢

正確答案：A. 給予排卵藥